淚囊鼻腔吻合術（dacryocystorhinostomy）較適用於下列那種病症？
A. 乾眼症
B. 鼻淚管阻塞
C. 淚點發育不全
D. 淚囊瘻管

正確答案：B. 鼻淚管阻塞